Immunocompromised conditions;

The above is a clinical trial exclusion criterion. Annotated with entity spans:
[Condition: Immunocompromised conditions];